Clinical trial inclusion criterion:
a cardioembolic event, which occurred on anticoagulation, or

Entity relations:
- Has_temporal("cardioembolic event", "occurred on anticoagulation")